Clinical trial inclusion criterion:
Those who age between 30 and 80 years old and can inject insulin by themselves.

Entity relations:
- Has_value("age", "between 30 and 80 years old")
- Has_context("inject insulin", "can")